¿Cuál es el periodo máximo de tiempo tras el acontecimiento traumático en el que se puede hacer un diagnóstico de Trastorno de Estrés Agudo?:
1. Tres días.
2. Una semana.
3. Un mes.
4. Tres meses.

Respuesta correcta: 3. Un mes.